Clinical trial exclusion criterion:
Ejection fraction <35%

Annotated entities:
- Measurement: "Ejection fraction"
- Value: "<35%"